有一糖尿病病人，其高血壓已有兩年，大都在 160-170/90-100 mmHg 之間，現在找你治療，你的治療目標應在那個範圍？
A. ≤ 160/95 mmHg
B. ≤ 140/90 mmHg
C. ≤ 130/80 mmHg
D. ≤ 110/70 mmHg

正確答案：C. ≤ 130/80 mmHg